40歲健康工人於密閉工廠工作時遭遇火警，逃生通道卻又被雜物堵塞。此工人經過一段時間搬離雜物才脫離 火場。現場濃煙密布，他吸入不少煙霧；加上他的臉被燻黑、鼻毛及前額毛髮又被燒焦、兩側上肢也被燒
 傷，因而來急診求診。關於他的傷勢及醫療處置，下列敘述何者錯誤？
A. 此病患有可能遭受肺部吸入性灼傷（inhalation injury）
B. 因為此傷患沒有聲音沙啞（hoarseness）、哮喘（wheezing）、或含碳渣痰液（carbonaceous  	sputum），胸部X光也沒有異常因此不應該立即進行支氣管鏡或氣管插管等侵入性診治。
C. 臨床研究顯示，液體限制（fluid restriction）無法預防吸入性灼傷引起的肺水腫
D. 在後續的治療上，除非有證據顯示肺臟感染，不建議一開始就給予預防性抗生素

正確答案：B. 因為此傷患沒有聲音沙啞（hoarseness）、哮喘（wheezing）、或含碳渣痰液（carbonaceous  	sputum），胸部X光也沒有異常因此不應該立即進行支氣管鏡或氣管插管等侵入性診治。